Judged unable to comply with the training protocol.

The above is a clinical trial exclusion criterion. Annotated with entity spans:
[Post-eligibility: Judged unable to comply with the training protocol.]